Clinical trial inclusion criterion:
Patient must give written informed consent before participating in any study-specific procedure, randomization, or receiving investigational product.

Entity relations:
- multi("participating in any study-specific procedure, randomization, or receiving investigational product", "study-specific")
- Has_temporal("informed consent", "before participating in any study-specific procedure, randomization, or receiving investigational product")
- Has_index("before participating in any study-specific procedure, randomization, or receiving investigational product", "participating in any study-specific procedure, randomization, or receiving investigational product")
- OR("study-specific", "investigational product", "procedure", "randomization")